Clinical trial inclusion criterion:
Newly dignosised type 2 diabetes according to WHO criteria.glycated hemoglobin (HbA1c) was more than 10%;

Entity relations:
- Has_qualifier("type 2 diabetes", "WHO criteria")
- Has_temporal("type 2 diabetes", "Newly dignosised")
- Has_value("glycated hemoglobin (HbA1c)", "more than 10%")